Clinical trial exclusion criterion:
Other conditions regimented at investigators' discretion.

Annotated entities:
- Non-query-able: "Other conditions regimented at investigators' discretion"